El pH de una disolución de ácido nítrico 0,1 M es:
1. Igual a 0,1.
2. Igual a 7,0.
3. Mayor que 7,0.
4. Menor que 7,0.

Respuesta correcta: 4. Menor que 7,0.